急性胰臟炎發作時，最先被活化的酵素為何？
A. 胰澱粉酶（pancreatic amylase）
B. 胰蛋白酶（trypsin）
C. 胰糜蛋白酶（chymotrypsin）
D. 胰脂肪酶（pancreatic lipase）

正確答案：B. 胰蛋白酶（trypsin）